Clinical trial exclusion criterion:
Untreated, severe, left sided valvular heart disease including mitral regurgitation or stenosis, and aortic regurgitation or stenosis.

Annotated entities:
- Condition: "valvular heart disease"
- Qualifier: "left sided"
- Qualifier: "severe"
- Qualifier: "Untreated"
- Condition: "mitral regurgitation"
- Condition: "mitral stenosis"
- Condition: "aortic regurgitation"
- Condition: "aortic stenosis"